下列那一種藥物可能影響甲狀腺功能檢查，使 T4 值增高？
A. lithium
B. androgens
C. amiodarone
D. salicylates

正確答案：C. amiodarone